Clinical trial exclusion criterion:
Controls (without a history of TBI):

Annotated entities:
- Parsing_Error: "Controls (without a history of TBI):"